Clinical trial exclusion criterion:
Presence of severe cerebrovascular disorders (diagnosis of stroke, cerebral infarction or cerebral hemorrhage within recent 6 months)

Entity relations:
- Has_qualifier("cerebrovascular disorders", "severe")
- Has_temporal("stroke", "within recent 6 months")
- Subsumes("cerebrovascular disorders", "stroke")
- OR("stroke", "cerebral infarction", "cerebral hemorrhage")